BMI = 35

The above is a clinical trial inclusion criterion. Annotated with entity spans:
[Measurement: BMI] [Value: = 35]